Clinical trial exclusion criterion:
Plan to remove the tumor surgically before completing the protocol chemo/radiotherapy course

Annotated entities:
- Temporal: "before completing the protocol chemo/radiotherapy course"
- Mood: "Plan to remove the tumor surgically"